¿Qué efecto tiene la depresión de los progenitores en la psicopatología de los hijos durante su infancia?:
1. Aumenta el riesgo de padecer trastornos afectivos pero no el de padecer trastornos de ansiedad.
2. Impide desarrollar una relación de apego seguro con el progenitor.
3. Aumenta de forma específica la probabilidad de padecer un trastorno de conducta debido a la alteración de la crianza.
4. Sus consecuencias negativas se manifiestan en múltiples áreas del funcionamiento del niño.

Respuesta correcta: 4. Sus consecuencias negativas se manifiestan en múltiples áreas del funcionamiento del niño.